What happens upon disruption of a TAD boundary?

Disruption of a TAD boundary causes ectopic chromosomal contacts and long-range transcriptional misregulation. Disruptions of topological chromatin domains cause pathogenic rewiring of gene-enhancer interactions. Both in mouse limb tissue and patient-derived fibroblasts, disease-relevant structural changes cause ectopic interactions between promoters and non-coding DNA, and a cluster of limb enhancers normally associated with Epha4 is misplaced relative to TAD boundaries and drives ectopic limb expression of another gene in the locus. This rewiring occurred only if the variant disrupted a CTCF-associated boundary domain.